63 歲男性，患有肺癌接受化學治療三天後，因意識不清被送至急診處。家人告知：病人食慾不好，有噁心但無嘔吐；身體診查：體溫 36.8°C，血壓 124/75 mmHg，脈搏 78/min，呼吸 18/min。病人除對時空有錯亂及嗜睡外，其他神經學檢查無異常；下肢無水腫；尿液檢查正常；尿素氮 18 mg/dL，尿酸 2.5 mg/dL，ALT 20 U/L，血糖 108 mg/dL。血清電解質：Na+ 118，K+ 3.5，Cl- 79，free calcium 2.4 （電解質單位 mmol/L）；病人尿液的滲透壓是 290 mOsmol/kg H2O。對此病人下列敘述何者錯誤？
A. 病人的血清滲透壓估算大約是 250 mOsmol/kg H2O
B. 病人的抗利尿激素（antidiuretic hormone）是沒有分泌的
C. 病人應該限制水分攝取
D. 用高濃度的食鹽水靜脈輸注時，應該每 2 小時監測血清鈉濃度，如果超過 130 mmol/L 就應該停止

正確答案：B. 病人的抗利尿激素（antidiuretic hormone）是沒有分泌的